Patients participate in other clinical studies;

The above is a clinical trial exclusion criterion. Annotated with entity spans:
[Competing_trial: Patients participate in other clinical studies];